Clinical trial inclusion criterion:
The patient is determined by a board certified neurosurgeon to have a tumor or vascular lesion that would take up fluorescein

Entity relations:
- multi("would take up fluorescein", "fluorescein")
- Has_qualifier("tumor", "would take up fluorescein")
- OR("tumor", "vascular lesion")